Clinical trial inclusion criterion:
6. Total occluded vessels. One total occluded major epicardial vessel or side branch can be included and targeted as long as one other major vessel has a significant stenosis amenable for SA, provided the age of occlusion is less than one month e.g. recent instability, infarction with ECG changes in the area subtended by the occluded vessel. Patients with total occluded vessels of unknown duration or existing longer than one month and a reference over 1.50 mm should not be included, not even as a third or fourth vessel to be dilated;

Annotated entities:
- Condition: "total occluded vessels"
- Temporal: "unknown duration"
- Temporal: "longer than one month"
- Value: "over 1.50 mm"
- Measurement: "reference"
- Condition: "Total occluded vessels"
- Multiplier: "One"
- Condition: "total occluded major epicardial vessel"
- Condition: "total occluded side branch"